Clinical trial exclusion criterion:
Household members of children in Group A

Entity relations:
- AND("Household members", "children")
- AND("Household members", "Group A")